What 2 biological processes are regulated by STAMP2 in adipocytes?

Inflammation, insulin resistance and metabolic response are regulated by STAMP2 in adipocytes.